Clinical trial exclusion criterion:
Age < 18 years

Entity relations:
- Has_value("Age", "< 18 years")